下列有關翼腭窩（pterygopalatine fossa）之敘述，何者錯誤？
A. 上頜動脈（maxillary artery）之第三部分進入此窩
B. 由翼腭窩向內經鼻腭孔（nasopalatine foramen）進入鼻腔
C. 上頜神經（maxillary nerve）經過此窩
D. 此窩中之副交感神經節前纖維來自翼管（pterygoid canal）

正確答案：B. 由翼腭窩向內經鼻腭孔（nasopalatine foramen）進入鼻腔